Clinical trial exclusion criterion:
Extracranial active bleeding

Entity relations:
- Has_qualifier("Extracranial bleeding", "active")